Synostosis of which cranial structures are characteristic to the Mercedes Benz syndrome?

Synostosis of sagittal and lambdoid structures are characteristic to the Mercedes Benz syndrome.